對於肝腎症候群（hepatorenal syndrome）之敘述，下列何者錯誤？
A. 肝硬化（liver cirrhosis）的病人在抽腹水（paracentesis）時，不要過量，以免造成肝腎症候群
B. 肝功能改善時，腎功能不會隨著改善
C. 若把肝腎症候群病人的腎臟捐給沒有肝病的人，則此腎之功能可以恢復
D. 肝腎症候群的診斷，需先排除其他可能因素

正確答案：B. 肝功能改善時，腎功能不會隨著改善